Ordene los siguientes compuestos por punto de ebullición decreciente: 1-butanol, cloroetano, 1-propanol, butano.
1. 1-Butanol > cloroetano > butano >1propanol.
2. 1-Propanol> 1-butanol > butano >cloroetano.
3. 1-Butanol > 1-propanol > cloroetano >butano.
4. Cloroetano > 1-butanol > butano > 1propanol.

Respuesta correcta: 3. 1-Butanol > 1-propanol > cloroetano >butano.